Clinical trial exclusion criterion:
Pregnant or nursing women, or females with a positive pregnancy test at screening

Entity relations:
- Has_temporal("pregnancy test", "at screening")
- Has_value("pregnancy test", "positive")
- Has_index("at screening", "screening")
- OR("Pregnant", "nursing")
- OR("Pregnant", "females")
- OR("women", "females")